Drug abuse

The above is a clinical trial inclusion criterion. Annotated with entity spans:
[Condition: Drug abuse]